El miedo o creencia de padecer una enfermedad importante, que surge en el sujeto a partir de la interpretación errónea de sus síntomas corporales, es la característica nuclear de:
1. El trastorno de conversión.
2. La hipocondría.
3. El trastorno de pánico.
4. La depresión
5. La somatización.

Respuesta correcta: 2. La hipocondría.